Clinical trial exclusion criterion:
Systemic corticotherapy or immunosuppressive treatment during the previous month, or local corticoid treatment the week before the patch testing.

Entity relations:
- Has_temporal("Systemic corticotherapy", "during the previous month")
- OR("Systemic corticotherapy", "immunosuppressive treatment")